Patients with a life expectancy of less than 1 year

The above is a clinical trial exclusion criterion. Annotated with entity spans:
Patients with a [Observation: life expectancy] of [Value: less than 1 year]